Walking capacity significantly limited by conditions other than claudication including leg (joint/musculoskeletal, neurologic) and systemic (heart, lung disease) pathology,

The above is a clinical trial exclusion criterion. Annotated with entity spans:
[Measurement: Walking capacity] [Value: significantly limited] by [Condition: conditions other than claudication] including [Condition: leg] ([Qualifier: joint]/[Qualifier: musculoskeletal], [Qualifier: neurologic]) and [Condition: systemic] ([Condition: heart], [Condition: lung disease]) pathology,